17. Active, uncontrolled infection

The above is a clinical trial exclusion criterion. Annotated with entity spans:
17. [Temporal: Active], [Qualifier: uncontrolled] [Condition: infection]